More than three doses of any opioid within one week of surgery

The above is a clinical trial exclusion criterion. Annotated with entity spans:
[Multiplier: More than three doses] of any [Drug: opioid] [Temporal: within one week of surgery]